Clinical trial exclusion criterion:
Renal insufficiency defined as creatinine clearance < 60 mL/min

Entity relations:
- AND("Renal insufficiency", "creatinine clearance")
- Has_value("creatinine clearance", "< 60 mL/min")